Clinical trial inclusion criterion:
the last vaccination intervals = 14 days and the last attenuated live vaccine intervals=28days

Annotated entities:
- Observation: "last vaccination intervals"
- Value: "= 14 days"
- Observation: "last attenuated live vaccine intervals"
- Value: "=28days"